Clinical trial inclusion criterion:
BRCA1 carrier

Annotated entities:
- Condition: "BRCA1 carrier"